A priori access must be right or left radial artery.

The above is a clinical trial inclusion criterion. Annotated with entity spans:
A [Qualifier: priori] [Procedure: access] must be [Qualifier: right] or [Qualifier: left radial artery].